Clinical trial exclusion criterion:
Glaucoma, pheochromocytoma, or known or suspected hypersensitivity to methylphenidate or its excipients

Annotated entities:
- Condition: "Glaucoma"
- Condition: "pheochromocytoma"
- Condition: "hypersensitivity"
- Drug: "methylphenidate or its excipients"
- Drug: "its excipients"
- Observation: "suspected"
- Observation: "known"